一位 65 歲男性肺結核病患，服用第一線四種抗結核藥物後，一個月後出現視力模糊，是下列那一種藥物所造成之副作用？
A. rifampin
B. isoniazide
C. ethambutol
D. pyrazinamide

正確答案：C. ethambutol